Clinical trial exclusion criterion:
Patients considered to be at risk of bradycardic events (e.g., known sick sinus syndrome or second or third degree atrioventricular [AV)] block) unless already treated with a permanent pacemaker

Annotated entities:
- Condition: "bradycardic events"
- Mood: "at risk of"
- Condition: "sick sinus syndrome"
- Condition: "third degree atrioventricular [AV)] block"
- Condition: "second degree atrioventricular [AV)] block"
- Device: "permanent pacemaker"
- Negation: "unless"